Clinical trial exclusion criteria:
Documented renal failure
documented allergy to iodine or shellfish
previous spine fusion surgery
undergoing elective posterior spine single-level instrumentation surgery
undergoing anterior spine multi-level instrumentation surgery
current antibiotic use.

Annotated entities:
- Condition: "renal failure"
- Condition: "allergy"
- Drug: "iodine"
- Drug: "shellfish"
- Procedure: "spine fusion surgery"
- Temporal: "previous"
- Qualifier: "elective"
- Qualifier: "posterior spine"
- Procedure: "single-level instrumentation surgery"
- Temporal: "undergoing"
- Qualifier: "anterior spine"
- Procedure: "multi-level instrumentation surgery"
- Temporal: "undergoing"
- Drug: "antibiotic use"
- Temporal: "current"